7. BUN or creatine above the normal limits.

The above is a clinical trial exclusion criterion. Annotated with entity spans:
7. [Measurement: BUN] or [Measurement: creatine] [Value: above the normal limits].